Clinical trial exclusion criterion:
anaemia (Hb <105 g/L [10.5 g/dL]) at inclusion, lack of informed consent

Entity relations:
- Subsumes("<105 g/L", "10.5 g/dL")
- Has_value("Hb", "<105 g/L")
- Subsumes("anaemia", "Hb")
- Has_temporal("anaemia", "at inclusion")